Clinical trial exclusion criterion:
Indications for concomitant treatment with antiplatelet agents

Entity relations:
- Has_mood("antiplatelet agents", "Indications")
- Has_temporal("antiplatelet agents", "concomitant")